Myocardial infarction, cardiac arrest or cardiac failure within 1 year before screening/baseline visit;

The above is a clinical trial exclusion criterion. Annotated with entity spans:
[Condition: Myocardial infarction], [Condition: cardiac arrest] or [Condition: cardiac failure] [Temporal: within 1 year before screening/baseline visit];